patient with a measure of legal protection

The above is a clinical trial exclusion criterion. Annotated with entity spans:
[Post-eligibility: patient with a measure of legal protection]